Patient not requiring IV morphine (pain score 5/10 or less)

The above is a clinical trial exclusion criterion. Annotated with entity spans:
Patient [Negation: not] [Mood: requiring] [Drug: IV morphine] ([Measurement: pain score] [Value: 5/10 or less])